Clinical trial exclusion criterion:
Mitral or aortic valve stenosis greater than mild (ie, aortic stenosis: jet >3.0 meters per second [m/s], mean gradient >25 millimeters of mercury [mmHg], and aortic valve area <1.5 centimeters squared [cm^2]; mitral stenosis: mean gradient >5 mmHg and mitral valve area <1.5 cm^2)

Entity relations:
- Has_qualifier("Mitral valve stenosis", "greater than mild")
- Has_value("jet", ">3.0 meters per second [m/s]")
- Has_value("mean gradient", ">25 millimeters of mercury [mmHg]")
- Has_value("aortic valve area", "<1.5 centimeters squared [cm^2]")
- Has_value("mean gradient", ">5 mmHg")
- Has_value("mitral valve area", "<1.5 cm^2")
- AND("aortic stenosis", "jet")
- AND("mitral stenosis", "mean gradient")
- AND("Mitral valve stenosis", "aortic stenosis")
- AND("aortic stenosis", "mean gradient")
- AND("aortic stenosis", "aortic valve area")
- AND("mitral stenosis", "mitral valve area")
- OR("Mitral valve stenosis", "aortic valve stenosis")